Clinical trial exclusion criterion:
Presence of a cardiac pacemaker or stimulator

Annotated entities:
- Device: "cardiac pacemaker"
- Device: "cardiac stimulator"